Clinical trial inclusion criterion:
Signed informed consent either from the patient, their legally authorized representative or a direct family member

Annotated entities:
- Informed_consent: "Signed informed consent either from the patient, their legally authorized representative or a direct family member"